Has ever received any cytotoxic drugs, including chlorambucil, cyclophosphamide, nitrogen mustard, or other alkylating agents

The above is a clinical trial exclusion criterion. Annotated with entity spans:
Has ever received any [Drug: cytotoxic drugs], including [Drug: chlorambucil], [Drug: cyclophosphamide], [Drug: nitrogen mustard], or other [Drug: alkylating agents]